HIV or other chronic disease

The above is a clinical trial exclusion criterion. Annotated with entity spans:
[Condition: HIV] or [Qualifier: other] [Condition: chronic disease]